No legal ability or legal ability is limited.

The above is a clinical trial exclusion criterion. Annotated with entity spans:
[Post-eligibility: No legal ability or legal ability is limited].